Sepsis due to MDR or minimally susceptible gram-negative bacteria

The above is a clinical trial inclusion criterion. Annotated with entity spans:
[Condition: Sepsis] due to [Qualifier: MDR] or [Condition: minimally susceptible gram-negative bacteria]